Patients who agree to participate in the Trial by signing the Specific Informed Consent of this study.

The above is a clinical trial inclusion criterion. Annotated with entity spans:
[Informed_consent: Patients who agree to participate in the Trial by signing the Specific Informed Consent of this study.]